Serum creatinine less than or equal to 2.0 mg/dL (Note: Patients with a serum creatinine greater than or equal to 1.4 and less than or equal to 2.0 mg/dL must demonstrate a 24-hour urinary creatinine clearance greater than or equal to 50 mL/min)

The above is a clinical trial inclusion criterion. Annotated with entity spans:
[Measurement: Serum creatinine] [Value: less than] or [Value: equal to 2.0 mg/dL] (Note: Patients with a [Measurement: serum creatinine] [Value: greater than] or [Value: equal to 1.4] and [Value: less than] or [Value: equal to 2.0 mg/dL] must demonstrate a [Measurement: 24-hour urinary creatinine clearance] [Value: greater than] or [Value: equal to 50 mL/min])